Clinical trial exclusion criterion:
Previous hyperresponse with OHSS development

Entity relations:
- Has_context("hyperresponse", "OHSS development")
- Has_temporal("hyperresponse", "Previous")